Any known psychiatric disorder

The above is a clinical trial exclusion criterion. Annotated with entity spans:
Any known [Condition: psychiatric disorder]